8. Active Hepatitis A, Hepatitis B, or Hepatitis C infection

The above is a clinical trial exclusion criterion. Annotated with entity spans:
[Parsing_Error: 8.] Active [Condition: Hepatitis A], [Condition: Hepatitis B], or [Condition: Hepatitis C] infection